Clinical trial exclusion criterion:
Patients are not expected to be alive for longer than 3 months.

Annotated entities:
- Observation: "expected to be alive"
- Negation: "not"
- Value: "longer than 3 months"